Clinical trial inclusion criterion:
Pregnant women between 34-42 weeks gestation

Entity relations:
- Has_value("gestation", "between 34-42 weeks")